Clinical trial exclusion criterion:
Active infections

Annotated entities:
- Condition: "infections"
- Undefined_semantics: "infections"
- Temporal: "Active"